Clinical trial exclusion criterion:
History of hypertensive encephalopathy or cerebrovascular accident at any time prior to Visit1.

Entity relations:
- AND("History", "hypertensive encephalopathy")
- Has_temporal("hypertensive encephalopathy", "any time prior")
- OR("hypertensive encephalopathy", "cerebrovascular accident")